Clinical trial inclusion criterion:
Given Ante-natal Cards of the Ghana Health Service

Annotated entities:
- Non-representable: "Given Ante-natal Cards of the Ghana Health Service"